¿Cuáles son las características que favorecen la motivación intrínseca?
1. Autodeterminación y competencia.
2. Condescendencia y complejidad.
3. Rutina y condescendencia.
4. Novedad e imprevisibilidad.
5. Sencillez y recompensa.

Respuesta correcta: 1. Autodeterminación y competencia.